下列造成庫欣氏症候群（Cushing syndrome）的成因中，何者與促腎上腺皮質激素（ACTH）的過度分泌無關？
A. 先天性腎上腺增生症（congenital adrenal hyperplasia）
B. 腦下垂體前葉產生促腎上腺皮質激素分泌腫瘤（ACTH-secreting tumor）
C. 下視丘促腎上腺皮質激素釋放激素（CRH）分泌過量
D. 異位性促腎上腺皮質激素分泌過多症（ectopic ACTH syndrome）

正確答案：A. 先天性腎上腺增生症（congenital adrenal hyperplasia）